Clinical trial exclusion criterion:
Current acute decompensated heart failure (exacerbation of chronic heart failure manifested by signs and symptoms that may require intravenous therapy).

Entity relations:
- Has_qualifier("heart failure", "decompensated")
- Has_qualifier("heart failure", "acute")
- AND("exacerbation", "chronic heart failure")
- AND("exacerbation", "signs")
- AND("signs", "intravenous therapy")
- AND("signs", "symptoms")
- AND("symptoms", "intravenous therapy")